Clinical trial inclusion criterion:
Clinical diagnosis of a Grade I or II ankle sprain

Annotated entities:
- Qualifier: "Grade I"
- Qualifier: "Grade II"
- Condition: "ankle sprain"